下列何者可經由抑制 5-lipoxygenase 的作用，用來當作治療氣喘的藥品？
A. Montelukast
B. Zileuton
C. Nedocromil
D. Salmeterol

正確答案：B. Zileuton